Renal failure (eGFR <30 or requiring dialysis)

The above is a clinical trial exclusion criterion. Annotated with entity spans:
[Condition: Renal failure] ([Measurement: eGFR] [Value: <30] or [Mood: requiring] [Procedure: dialysis])